Clinical trial exclusion criterion:
Skin infections at the inclusion visit

Annotated entities:
- Condition: "Skin infections"
- Temporal: "at the inclusion visit"
- Visit: "inclusion visit"